Patient with health problems or a skin disease precluding continuous subcutaneous infusion

The above is a clinical trial exclusion criterion. Annotated with entity spans:
Patient with [Condition: health problems] or a [Condition: skin disease] [Negation: precluding] [Procedure: continuous subcutaneous infusion]